Clinical trial inclusion criterion:
major depressive episode in type2 bipolar disorder or bipolar disorder NOS.(MADRS more than 20 point)

Entity relations:
- Has_qualifier("bipolar disorder", "NOS")
- Has_value("MADRS", "more than 20 point")
- Subsumes("major depressive episode", "MADRS")
- AND("major depressive episode", "type2 bipolar disorder")
- OR("type2 bipolar disorder", "bipolar disorder")